一位氣喘患者，在白天時一星期有 2 次會覺得胸悶且有咳嗽的情形；但肺功能顯示正常。下列何者最不可能是此病人每天需要使用的控制（controller）藥物？
A. 低劑量吸入型類固醇
B. 茶鹼（Theophylline）
C. leukotriene modifier
D. 短效β2-agonist

正確答案：D. 短效β2-agonist